Clinical trial inclusion criterion:
temperature = 37<U+2103>

Entity relations:
- Has_value("temperature", "= 37<U+2103>")